Clinical trial inclusion criterion:
M. perstans mg-positive status Good general health without any clinical condition requiring long-term medication.

Entity relations:
- Has_value("M. perstans mg", "positive")
- Has_qualifier("clinical condition requiring long-term medication", "requiring long-term medication")
- AND("requiring long-term medication", "long-term medication")
- Has_negation("clinical condition requiring long-term medication", "without")